Clinical trial inclusion criterion:
Patients undergoing percutaneous coronary intervention and need to take dual antiplatelet therapy continuously at least 12weeks

Annotated entities:
- Procedure: "percutaneous coronary intervention"
- Procedure: "dual antiplatelet therapy"
- Qualifier: "continuously"
- Temporal: "at least 12weeks"